使用口服避孕藥的絕對禁忌症有：
A. 骨盆腔炎症
B. 血栓靜脈炎
C. 飲酒習慣者
D. 月經周期不準者

正確答案：B. 血栓靜脈炎